Eastern Cooperative Oncology Group (ECOG) score of 0, 1 or 2 (patients that spend less than 50% of time in bed during the day)

The above is a clinical trial inclusion criterion. Annotated with entity spans:
[Measurement: Eastern Cooperative Oncology Group (ECOG) score] of [Value: 0, 1 or 2] (patients that [Measurement: spend] [Value: less than 50%] of time in bed during the day)